婦女懷孕時補充攝取以下那一種維生素，已被証實可有效降低生下的小孩罹患神經管缺損（neural tube defects）之機率？
A. 維生素 B1（thiamine）
B. 維生素 B6（pyridoxine）
C. 維生素 B9（folic acid）
D. 維生素 B12（cobalamin）

正確答案：C. 維生素 B9（folic acid）